一位 18 歲高中畢業生，自小朋友很少且獨來獨往，功課普通可符合學校要求，對於天文學非常投入，有超乎同儕的天文常識，只要上課提及天文學可以侃侃而談，但他因為人際關係差，以致於難以就業。此個案最可能的診斷是：
A. 智能發展障礙（mental retardation）
B. 社交畏懼症（social phobia）
C. 亞斯伯格症（Asperger's disorder）
D. 類精神分裂人格障礙症（schizoid personality disorder）

正確答案：C. 亞斯伯格症（Asperger's disorder）